El virus de la hepatitis B:
1. Posee RNA bicatenario circular como material genético.
2. Posee RNA monocatenario circular como material genético.
3. Se transmite por vía aérea.
4. Codifica una transcriptasa inversa.
5. No tiene tropismo tisular.

Respuesta correcta: 4. Codifica una transcriptasa inversa.